Clinical trial exclusion criterion:
Use of antihistamine within the past 72 hours

Entity relations:
- Has_temporal("antihistamine", "within the past 72 hours")